下列那一種微生物導致腹瀉所需之致病原數量最大？
A. Shigella
B. Entamoeba histolytica
C. Giardia lamblia
D. Vibrio cholerae

正確答案：D. Vibrio cholerae